Clinical trial exclusion criterion:
Hypertrophic or restrictive cardiomyopathy.

Annotated entities:
- Condition: "restrictive cardiomyopathy"
- Condition: "Hypertrophic cardiomyopathy"